Clinical trial inclusion criterion:
• Arthritis (physician-diagnosed)

Annotated entities:
- Condition: "Arthritis"